What constitutes an increased risk for individuals with Fanconi anemia?

Fanconi anemia is a rare genetic disorder associated with an increased risk of leukemias and solid tumors.